Clinical trial inclusion criterion:
7. Age ≥18 years.

Entity relations:
- Has_value("Age", "≥18 years")